Clinical trial inclusion criterion:
Multiple contiguous gingival recession defects on a minimum of two adjacent teeth, exhibiting 3mm or more recession on at least one of those teeth

Entity relations:
- Has_multiplier("gingival recession defects", "Multiple")
- Has_multiplier("gingival recession defects", "minimum of two")
- Has_value("recession", "3mm or more")
- Has_multiplier("recession", "at least one")
- AND("gingival recession defects", "recession")